and any obvious infection or inflammation over a period of at least 1 month before the study.

The above is a clinical trial exclusion criterion. Annotated with entity spans:
and any [Qualifier: obvious] [Condition: infection] or [Condition: inflammation] over a period of [Temporal: at least 1 month before the study].